Clinical trial exclusion criterion:
Use of pharmacotherapy in the month prior to enrollment, including prior use of varenicline

Entity relations:
- Has_index("month prior to enrollment", "enrollment")
- Has_temporal("pharmacotherapy", "month prior to enrollment")